Al realizar un electrocardiograma, podemos observar que el paciente se encuentra en ritmo sinusal cuando:
1. Observamos ondas     P positivas en II, III y aVF.
2. Observamos ondas     P negativas en II, III y aVF.
3. No existen ondas P   delante de los complejos QRS.
4. Observamos ondas     P positivas en II, III y aVR.

Respuesta correcta: 1. Observamos ondas     P positivas en II, III y aVF.